對於 Herpes Stomatitis 治療，下列何者正確？
A. 先症狀治療
B. 須給 Anti-viral 藥物
C. 須給 Antibiotics 藥物
D. 須給 Anti-viral 及 Antibiotics 治療

正確答案：A. 先症狀治療